diagnosed any form of MS (relapsing remitting, primary progressive, secondary progressive), any EDSS (expanded stability status scale) score

The above is a clinical trial inclusion criterion. Annotated with entity spans:
diagnosed [Qualifier: any form] of [Condition: MS] ([Qualifier: relapsing remitting], [Qualifier: primary progressive], [Qualifier: secondary progressive]), [Value: any] EDSS ([Measurement: expanded stability status scale]) [Measurement: score]